Clinical trial exclusion criterion:
Hepatocellular carcinoma after liver transplantation.

Annotated entities:
- Condition: "Hepatocellular carcinoma"
- Procedure: "liver transplantation"
- Reference_point: "liver transplantation"
- Temporal: "after liver transplantation"